Clinical trial inclusion criterion:
has practiced adequate contraception for 30 days prior to vaccination, and

Annotated entities:
- Observation: "contraception"
- Qualifier: "adequate"
- Temporal: "30 days prior to vaccination"
- Reference_point: "vaccination"